Clinical trial inclusion criterion:
2. Visual analog scale more than or equal to 4

Annotated entities:
- Measurement: "Visual analog scale"
- Value: "more than or equal to 4"